Weight: more than 40 Kg

The above is a clinical trial inclusion criterion. Annotated with entity spans:
[Measurement: Weight]: [Value: more than 40 Kg]